Clinical trial exclusion criterion:
Inborn errors of metabolism that need protocol-determined fluid therapy

Annotated entities:
- Condition: "Inborn errors of metabolism"
- Mood: "need"
- Qualifier: "protocol-determined"
- Procedure: "fluid therapy"